1. Justification: Many illnesses may alter neural functioning as well as fMRI signals.

The above is a clinical trial inclusion criterion. Annotated with entity spans:
[Parsing_Error: 1.] [Not_a_criteria: Justification: Many illnesses may alter neural functioning as well as fMRI signals.]